Clinical trial inclusion criterion:
Medical history, concomitant medications

Annotated entities:
- Non-representable: "Medical history, concomitant medications"